COPD diagnosed according to GOLD, FEV1 40-80% predicted, SpO2 =92% at 750 m.

The above is a clinical trial inclusion criterion. Annotated with entity spans:
[Condition: COPD] diagnosed according to [Measurement: GOLD], [Measurement: FEV1] [Value: 40-80% predicted], [Measurement: SpO2] [Value: =92% at 750 m].